Clinical trial exclusion criterion:
Allergic reaction to poultry or previous viscosupplementation

Annotated entities:
- Condition: "Allergic reaction"
- Observation: "viscosupplementation"
- Observation: "poultry"